How is CTCF activated post-translationally?

Poly(ADP-ribosyl)ation regulates CTCF-dependent chromatin insulation.